Infertile lean women with PCOS as defined by the Rotterdam criteria.

The above is a clinical trial inclusion criterion. Annotated with entity spans:
[Condition: Infertile] lean [Person: women] with [Condition: PCOS] as defined by the [Qualifier: Rotterdam criteria].